Clinical trial exclusion criterion:
Allergy against to penicillin or cephalosporins

Annotated entities:
- Condition: "Allergy"
- Drug: "penicillin"
- Drug: "cephalosporins"